下列 eicosanoids 有血管收縮之作用，但是何者例外？
A. Thromboxane A2
B. Prostaglandin I2
C. Prostaglandin F2
D. Leukotriene D4

正確答案：B. Prostaglandin I2